有關肺通氣量與血液灌流量比值不吻合（VA /Q mismatch）之敘述，下列何者錯誤？
A. 不存在於正常的肺中
B. 肺泡無效腔（alveolar dead space）的形成，可增加VA /Q mismatch
C. 相較於肺通氣量，太多或太少的血液灌流量，皆可導致VA /Q mismatch
D. 慢性支氣管炎（chronic bronchitis）患者發生VA /Q mismatch 之機率較大

正確答案：A. 不存在於正常的肺中